Any abnormality of the cornea which may prevent reliable applanation tonometry

The above is a clinical trial exclusion criterion. Annotated with entity spans:
Any [Condition: abnormality] of the [Qualifier: cornea] which may prevent reliable applanation tonometry